Clinical trial inclusion criterion:
Anticipated ventilation of =72 hours at the time of screening, as per the ICU physician.

Annotated entities:
- Temporal: "=72 hours"
- Procedure: "ventilation"
- Mood: "Anticipated"